Clinical trial exclusion criterion:
Hepatic impairment

Annotated entities:
- Condition: "Hepatic impairment"